Clinical trial inclusion criterion:
Have symptoms of no longer than 7 days at point of hospitalisation.

Annotated entities:
- Condition: "symptoms"
- Temporal: "no longer than 7 days at point of hospitalisation"
- Reference_point: "hospitalisation"